What is the definitive treatment for low pressure headache?

epidural blood patch